下列何者屬於 opioid 類製劑，用於止瀉，正常用量不具成癮性或呼吸抑制作用？
A. codeine
B. meperidine
C. octreotide
D. loperamide

正確答案：D. loperamide